Clinical trial exclusion criterion:
Serum potassium >=5.1 mmol/L or <3.5 mmol/L at screening, confirmed by a single repeat if deemed necessary.

Annotated entities:
- Measurement: "Serum potassium"
- Value: ">=5.1 mmol/L"
- Value: "<3.5 mmol/L"
- Temporal: "at screening"